Clinical trial inclusion criterion:
Normal menstrual cycles: 25-34 days

Entity relations:
- Subsumes("Normal menstrual cycles", "25-34 days")